Clinical trial exclusion criterion:
Presence of VTE upon admission

Entity relations:
- Has_temporal("VTE", "upon admission")